Clinical trial exclusion criterion:
History of severe, clinically significant brain or spinal cord trauma (e.g., cerebral contusion, spinal cord compression)

Entity relations:
- Has_qualifier("brain trauma", "clinically significant")
- Has_qualifier("brain trauma", "severe")
- Subsumes("brain trauma", "cerebral contusion")
- OR("brain trauma", "spinal cord trauma")
- OR("cerebral contusion", "spinal cord compression")